What is the gene frequently mutated in Multiple endocrine neoplasia 2 (MEN2) and Hisrchsprung disease?

The Ret gene may have gain of mutation functions in MEN2 cancer as well as loss of function mutations in Hirschprung disease.